Clinical trial exclusion criterion:
Malignancies (<5 years)

Entity relations:
- Has_temporal("Malignancies", "<5 years")